下列何者不是 17-羥酶缺乏（17-hydroxylase deficiency）所導致先天性腎上腺增生（congenital adrenal  hyperplasia）的臨床表徵？
A. 罹患此症之女童會有性別難辨（ambiguous genitalia）
B. 高血壓
C. 血漿腎素活性（plasma renin activity）低
D. 低血鉀（hypokalemia）

正確答案：A. 罹患此症之女童會有性別難辨（ambiguous genitalia）